Clinical trial inclusion criterion:
No prior surgical treatment in the sites planned for therapy

Entity relations:
- Has_negation("surgical treatment", "No")